空氣污染物中所謂的氮氧化物，是指下列何者？
A. 一氧化氮與一氧化二氮
B. 一氧化氮與二氧化氮
C. 一氧化氮與氨氣
D. 二氧化氮與一氧化二氮

正確答案：B. 一氧化氮與二氧化氮